What is the main characteristic of Amyotrophic Lateral Sclerosis?

Amyotrophic lateral sclerosis (ALS) is a progressive degeneration of upper and lower motor neurons.